有關鼠蹊韌帶（inguinal ligament）的敘述，下列何者錯誤？
A. 外端附	於髂前下棘（anterior inferior iliac spine）
B. 內端附	於恥骨結節（pubic tubercle）
C. 由腹外斜肌（external abdominal oblique muscle）的腱膜形成
D. 淺鼠蹊環（superficial inguinal ring）位於其上方

正確答案：A. 外端附	於髂前下棘（anterior inferior iliac spine）